Clinical trial exclusion criteria:
Patients:
Who are pregnant or planning to become pregnant during the study or in the future
With a elevated post-void residual (defined as PVR > 100cc)
With a bleeding condition or on anti-coagulant therapy
With immunosuppression (i.e. HIV, lymphoma)
With multiple sclerosis or other progressive neurological disease
With evidence of a local or systemic infection, including urinary tract infection
With evidence of intrinsic sphincter deficiency as defined by a maximal urethral closure pressure of <20 cm H2O
Previous sub-urethral sling
Predominant overactive bladder symptoms

Annotated entities:
- Parsing_Error: "Patients:"
- Condition: "pregnant"
- Mood: "planning to become"
- Condition: "pregnant"
- Temporal: "during the study"
- Temporal: "in the future"
- Measurement: "post-void residual"
- Measurement: "PVR"
- Value: "> 100cc"
- Value: "elevated"
- Condition: "bleeding condition"
- Procedure: "anti-coagulant therapy"
- Condition: "HIV"
- Condition: "lymphoma"
- Observation: "immunosuppression"
- Condition: "multiple sclerosis"
- Condition: "progressive neurological disease"
- Condition: "systemic infection"
- Condition: "urinary tract infection"
- Condition: "local infection"
- Condition: "intrinsic sphincter deficiency"
- Measurement: "maximal urethral closure pressure"
- Value: "<20 cm H2O"
- Procedure: "sub-urethral sling"
- Temporal: "Previous"
- Condition: "overactive bladder symptoms"
- Qualifier: "Predominant"
- Condition: "overactive bladder"